Clinical trial inclusion criterion:
have a history of childhood trauma.

Annotated entities:
- Condition: "childhood trauma"
- Temporal: "history"